Clinical trial inclusion criteria:
Written maternal informed consent
Singleton pregnancy
Gestational age = 37 weeks,
ASA I
BMI < 30
fetus in cephalic presentation

Annotated entities:
- Post-eligibility: "Written maternal informed consent"
- Condition: "Singleton pregnancy"
- Measurement: "Gestational age"
- Value: "= 37 weeks"
- Measurement: "ASA"
- Value: "I"
- Measurement: "BMI"
- Value: "< 30"
- Condition: "cephalic presentatio"